Clinical trial exclusion criterion:
Patients affected by synovitis;

Annotated entities:
- Condition: "synovitis"